Clinical trial exclusion criteria:
Previous antispastic drugs
Contraindication for baclofen or toxin
Antecedent of epileptic seizure
Psychiatric antecedent

Annotated entities:
- Drug: "antispastic drugs"
- Temporal: "Previous"
- Condition: "Contraindication"
- Drug: "baclofen"
- Drug: "toxin"
- Condition: "epileptic seizure"
- Temporal: "Antecedent"
- Condition: "Psychiatric"
- Temporal: "antecedent"